56歲男性，有B型肝炎病史多年且有肝硬化，2個月前發生肝昏迷，經治療後改善，他家人發現他最近幾天有點異樣，就是有行為改變，且講話變得比較慢，也有嗜睡現象（drowsiness），此情形是肝腦病變（hepatic encephalopathy）的第幾期？
A. 第一期
B. 第二期
C. 第三期
D. 第四期

正確答案：B. 第二期